Clinical trial exclusion criterion:
Hypersensitivity or allergy to factor Xa inhibitors

Annotated entities:
- Condition: "Hypersensitivity"
- Condition: "allergy"
- Drug: "factor Xa inhibitors"